Clinical trial inclusion criterion:
Pathologic confirmation of lung adenocarcinoma with measurable disease, defined as at least one lesion that can be accurately measured in at least one dimension (longest diameter to be recorded on CT); Patients must have previously untreated locally advanced or metastatic NSCLC; Patients must have lung cancer with a documented EGFR activating mutation (exon 19 deletion, L858R).

Entity relations:
- Has_value("Pathologic", "confirmation")
- Has_qualifier("lung adenocarcinoma", "with measurable disease")
- Has_multiplier("lesion", "at least one")
- Has_qualifier("lesion", "can be accurately measured in at least one dimension")
- Has_qualifier("NSCLC", "locally advanced")
- Has_qualifier("NSCLC", "untreated")
- Has_qualifier("lung cancer", "with EGFR activating mutation")
- Subsumes("with EGFR activating mutation", "exon 19 deletion")
- AND("lung adenocarcinoma", "Pathologic")
- Subsumes("lung adenocarcinoma", "lesion")
- OR("locally advanced", "metastatic")
- OR("exon 19 deletion", "L858R")